Clinical trial exclusion criterion:
Evidence of neoplastic diseases of the liver

Entity relations:
- Has_qualifier("neoplastic diseases", "liver")